Clinical trial exclusion criterion:
Current use of Triptans (5HT1 Agonists)

Annotated entities:
- Drug: "Triptans"
- Drug: "5HT1 Agonists"